關於譫妄（delirium）的診斷，何者正確？
A. 主要核心症狀是定向感（orientation）障礙
B. 自然病程約數天到數週
C. 與物質濫用有關者，只在物質戒斷（substance withdrawal）時才會發生
D. 通常都緩慢發生，不容易注意到

正確答案：B. 自然病程約數天到數週